Clinical trial inclusion criterion:
Controlled hypertension: systolic BP < 150 and diastolic BP < 90 mmHg in persons aged 60 years or older, systolic BP < 140 and diastolic BP < 90 mmHg in persons 40 through 59 years according to the JNC 8th guideline

Annotated entities:
- Condition: "hypertension"
- Qualifier: "Controlled"
- Measurement: "systolic BP"
- Value: "< 150"
- Measurement: "diastolic BP"
- Value: "< 90 mmHg"
- Person: "aged"
- Value: "60 years or older"
- Measurement: "systolic BP"
- Value: "< 140"
- Measurement: "diastolic BP"
- Value: "< 90 mmHg"
- Person: "years"
- Value: "40 through 59"
- Qualifier: "JNC 8th guideline"